Clinical trial inclusion criterion:
ASA status I or II

Annotated entities:
- Measurement: "ASA status"
- Value: "I or II"